Clinical trial exclusion criterion:
Clinically significant abnormal laboratory result or physical examination finding not resolved by the time of baseline assessments.

Annotated entities:
- Non-query-able: "Clinically significant abnormal laboratory result or physical examination finding not resolved by the time of baseline assessments"